某送貨員個性緊張容易合併腹痛現象，一年前於高架道路塞車時，因腹痛及有腹瀉感近乎大便失禁的經	，此後個案不敢再開車上高架道路與高速公路而失去工作，隨後甚至不敢搭火車、公車、到人多或郊外無廁所的地方，而影響生活甚鉅。此個案最可能符合下列那個診斷？
A. 適應障礙症（adjustment disorder）
B. 創傷後壓力症（posttraumatic stress disorder）
C. 懼曠症（agoraphobia）
D. 泛焦慮症（generalized anxiety disorder）

正確答案：C. 懼曠症（agoraphobia）